Healthy obese male and female volunteers aged 18 to 55 years, inclusive. Heterozygous subjects may be 18 to 65 years inclusive.

The above is a clinical trial inclusion criterion. Annotated with entity spans:
[Condition: Healthy] [Condition: obese] [Person: male] [Grammar_Error: and] [Person: female] volunteers [Person: aged] [Value: 18 to 55 years, inclusive]. [Parsing_Error: Heterozygous subjects may be 18 to 65 years inclusive.]